Hyperthyroidism or hypothyroidism.

The above is a clinical trial exclusion criterion. Annotated with entity spans:
[Condition: Hyperthyroidism] or [Condition: hypothyroidism].